Clinical trial exclusion criterion:
4. Severe hypoglycemic episode within 1 month of screening.

Annotated entities:
- Parsing_Error: "4."
- Condition: "hypoglycemic episode"
- Qualifier: "Severe"
- Temporal: "within 1 month of screening"